Clinical trial exclusion criterion:
Subjects with kidney disease (except kidney stones).

Annotated entities:
- Condition: "kidney disease"
- Negation: "except"
- Condition: "kidney stones"